What is caused by de novo VPS4A mutations?

De-novo VPS4A mutations cause multisystem disease with abnormal neurodevelopment, including dyskinesias, dyslipidemia, and dysplastic skin and cartilaginous neoplasia, as well as an inability to control intracranial temperature.